Patients will not be included if they have reached a stable dose of warfarin, liver dysfunction, alcoholism, use of another anticoagulant, use of chemotherapy, or if they do not meet the inclusion criteria

The above is a clinical trial exclusion criterion. Annotated with entity spans:
Patients will not be included if they have reached a [Multiplier: stable dose] of [Drug: warfarin], [Condition: liver dysfunction], [Condition: alcoholism], use of [Qualifier: another] [Drug: anticoagulant], use of [Procedure: chemotherapy], or [Post-eligibility: if they do not meet the inclusion criteria]